Clinical trial inclusion criterion:
all adult patients with a nasal or facial skin/soft tissue defect requiring reconstruction limited to or including a full-thickness skin graft

Annotated entities:
- Condition: "facial skin/soft tissue defect"
- Condition: "nasal skin/soft tissue defect"
- Procedure: "reconstruction"
- Mood: "requiring"
- Device: "full-thickness skin graft"